一位神經學檢查均正常的 15 歲男孩，自小學起就因為上課時常打瞌睡而被老師處罰，開懷大笑時會突然下巴下垂無力，他辯稱非自己所能控制。下列敘述何者錯誤？
A. 最可能的診斷為 rapid eye movement（REM）sleep behavior disorder
B. 可伴有 hypnagogic hallucination 及 sleep paralysis
C. 有研究發現與 HLA-DQ（B1-0602）之基因有關
D. overnight polysomnography 及 multiple sleep latency test 可協助診斷

正確答案：A. 最可能的診斷為 rapid eye movement（REM）sleep behavior disorder